Clinical trial exclusion criterion:
NSAID and other analgesics used the 48 hours previous to the surgery

Entity relations:
- Has_qualifier("analgesics", "other")
- Has_index("48 hours previous to the surgery", "the surgery")
- Has_temporal("NSAID", "48 hours previous to the surgery")
- OR("NSAID", "analgesics")